Clinical trial exclusion criterion:
Endoscopic insertion of video capsule endoscope

Entity relations:
- AND("Endoscopic insertion", "video capsule endoscope")